醫師於僧帽瓣聽診出病患有舒張雜音（diastolic murmur），則其可能原因為何？
A. 左心室壓過高
B. 左心室壓過低
C. 僧帽瓣狹窄（stenosis）
D. 僧帽瓣閉鎖不全（insufficiency）

正確答案：C. 僧帽瓣狹窄（stenosis）